男性女乳症（gynecomastia）不發生於：
A. 肝硬化病人
B. 睪丸腫瘤（testicular tumor）病人
C. 正常男性
D. 女變男變性者

正確答案：D. 女變男變性者